What is the doRiNA database?

doRina is a database of RNA interactions in post-transcriptional regulation.